Clinical trial inclusion criterion:
Suspected coronary artery disease who are supposed to undergo invasive coronary angiography with appropriate clinical indications

Annotated entities:
- Condition: "coronary artery disease"
- Mood: "Suspected"
- Procedure: "invasive coronary angiography"
- Mood: "supposed to undergo"